Clinical trial inclusion criterion:
Psychiatrically stable enough to attend to completion (no hospitalisations or medication changes in last 4 weeks)

Entity relations:
- Has_temporal("hospitalisations", "in last 4 weeks")
- Has_negation("hospitalisations", "no")
- Subsumes("Psychiatrically stable", "hospitalisations")
- OR("hospitalisations", "medication changes")